Clinical trial exclusion criterion:
The patients have other cancers at the same time or have the history of other cancers except controlled skin basal cell carcinoma or skin squamous cell carcinoma or carcinoma in situ of cervix uterus;

Entity relations:
- Has_temporal("other cancers", "at the same time")
- Has_negation("controlled skin basal cell carcinoma", "except")
- AND("other cancers", "controlled skin basal cell carcinoma")
- OR("controlled skin basal cell carcinoma", "skin squamous cell carcinoma", "carcinoma in situ of cervix uterus")
- OR("other cancers", "other cancers")